一嬰兒出生幾天後發生嘔吐的現象，經診斷為腸道扭轉不全（Malrotation），引起此症狀最主要的原因為何？
A. 營養不良
B. 胎便排出困難
C. 肺形成不全
D. 十二指腸阻塞或中腸扭結（Midgut volvulus）

正確答案：D. 十二指腸阻塞或中腸扭結（Midgut volvulus）